Clinical trial exclusion criteria:
Patients who are recipients of multiple solid organ or islet cell tissue transplants, or have previously received an organ or tissue transplant. Patients who have a combined liver-kidney transplant.
History of malignancy of any organ system (other than localized basal cell carcinoma of the skin), treated or untreated, within the past 5 years, regardless of whether there is evidence of local recurrence or metastases.
Existence of any surgical, medical or mental conditions, other than the current transplantation, which, in the opinion of the investigator, might interfere with the objectives of the study.
Pregnant or nursing (lactating) women.

Annotated entities:
- Multiplier: "multiple"
- Procedure: "solid organ transplants"
- Procedure: "islet cell tissue transplants"
- Temporal: "previously"
- Procedure: "organ transplant"
- Procedure: "tissue transplant"
- Procedure: "combined liver-kidney transplant"
- Temporal: "History"
- Condition: "malignancy"
- Qualifier: "any organ system"
- Negation: "other than"
- Condition: "localized basal cell carcinoma of the skin"
- Qualifier: "treated"
- Qualifier: "untreated"
- Temporal: "within the past 5 years"
- Non-representable: "regardless of whether there is evidence of local recurrence or metastases"
- Condition: "surgical conditions"
- Condition: "medical conditions"
- Condition: "mental conditions"
- Negation: "other than"
- Temporal: "current"
- Procedure: "transplantation"
- Qualifier: "might interfere with the objectives of the study"
- Condition: "Pregnant"
- Observation: "nursing"
- Observation: "lactating"
- Person: "women"